Have a planned non-emergent surgical procedure or clinical situation (e.g., intubation) that requires moderate or deep NMB with either rocuronium or vecuronium.

The above is a clinical trial inclusion criterion. Annotated with entity spans:
Have a [Mood: planned] [Qualifier: non-emergent] [Procedure: surgical procedure] or [Condition: clinical situation] (e.g., [Procedure: intubation]) that requires [Qualifier: moderate] or [Qualifier: deep] [Procedure: NMB] with either [Drug: rocuronium] or [Drug: vecuronium].